Clinical trial inclusion criterion:
7. Signed informed consent

Annotated entities:
- Parsing_Error: "7."
- Post-eligibility: "Signed informed consent"
- Non-query-able: "Signed informed consent"